Clinical trial inclusion criterion:
significant symptomatic cardiac disease

Annotated entities:
- Qualifier: "symptomatic"
- Condition: "cardiac disease"
- Qualifier: "significant"